一位病人因鏈球菌導致瓣膜心內膜炎，而且他服用 penicillin G 會引起全身性過敏反應，下列何者是治療這位病人的首選藥物？
A. Vancomycin
B. Aztreonam
C. Cefazolin + gentamicin
D. Meropenem

正確答案：A. Vancomycin